Clinical trial inclusion criterion:
Patients must not have a serious medical or psychiatric illness which prevents informed consent or compliance with treatment.

Annotated entities:
- Post-eligibility: "Patients must not have a serious medical or psychiatric illness which prevents informed consent or compliance with treatment."